Clinical trial exclusion criterion:
Hypersensitivity to camptothecin or nucleoside analogues.

Entity relations:
- AND("Hypersensitivity", "camptothecin")
- OR("camptothecin", "nucleoside analogues")